Clinical trial exclusion criterion:
History of documented clotting/coagulation disorder

Annotated entities:
- Condition: "coagulation disorder"
- Condition: "clotting disorder"